Undifferentiated adenocarcinoma.

The above is a clinical trial exclusion criterion. Annotated with entity spans:
[Qualifier: Undifferentiated] [Condition: adenocarcinoma].